Metastatic tumor

The above is a clinical trial exclusion criterion. Annotated with entity spans:
[Qualifier: Metastatic] [Condition: tumor]